Clinical trial exclusion criterion:
Children who present to the PED with a rash, vomiting or current asthma symptoms including coughing, wheezing or breathing problems will also be excluded to ensure these do not mask reactions to an oral challenge.

Annotated entities:
- Person: "Children"
- Visit: "PED"
- Condition: "rash"
- Condition: "vomiting"
- Condition: "asthma symptoms"
- Condition: "coughing"
- Condition: "wheezing"
- Condition: "breathing problems"
- Temporal: "current"